聽神經瘤（acoustic neuroma）最好發於下列那一條顱神經？
A. 顏面神經（facial nerve）
B. 耳蝸神經（cochlear nerve）
C. 前庭神經（vestibular nerve）
D. 舌咽神經（glossopharyngeal nerve）

正確答案：C. 前庭神經（vestibular nerve）